Clinical trial exclusion criterion:
Central nervous system (CNS) infections or opportunistic conditions: brain abscess (bacterial, mycobacterial, fungal or Toxoplasma), meningitis with persistent neurologic impairment, primary CNS lymphoma, progressive multifocal leukoencephalopathy (PML), or another structural brain lesion with neurological sequelae

Annotated entities:
- Condition: "Central nervous system (CNS) infections"
- Condition: "Central nervous system (CNS) opportunistic conditions"
- Condition: "brain abscess"
- Condition: "meningitis"
- Condition: "neurologic impairment"
- Multiplier: "persistent"
- Qualifier: "bacterial"
- Qualifier: "mycobacterial"
- Qualifier: "fungal"
- Qualifier: "Toxoplasma"
- Condition: "CNS lymphoma"
- Condition: "progressive multifocal leukoencephalopathy (PML)"
- Qualifier: "another"
- Condition: "structural brain lesion"
- Condition: "neurological sequelae"
- Qualifier: "primary"